Anemia (hemoglobin <8 g/dl)

The above is a clinical trial exclusion criterion. Annotated with entity spans:
[Condition: Anemia] ([Measurement: hemoglobin] [Value: <8 g/dl])